下列有關腎臟外傷的敘述，何者錯誤？
A. 腎臟鈍傷（blunt injury）大多因腹部撞擊而發生，占腎臟外傷發生率之 80～85%
B. 腎臟鈍傷最常見為一級傷害，亦即表示傷害到腎臟髓質
C. 血尿之嚴重度與腎臟受傷之程度無關
D. 腎臟鈍傷後，1%之病患日後可能產生高血壓

正確答案：B. 腎臟鈍傷最常見為一級傷害，亦即表示傷害到腎臟髓質